Male or non-pregnant, non-lactating female patients at least 18 years of age

The above is a clinical trial inclusion criterion. Annotated with entity spans:
[Pregnancy_considerations: Male or non-pregnant, non-lactating female patients at least 18 years of age]